Clinical trial exclusion criterion:
Eating Disorder (anorexia nervosa, bulimia)

Entity relations:
- Subsumes("Eating Disorder", "anorexia nervosa")
- OR("anorexia nervosa", "bulimia")